type 1 diabetic or non-diabetic

The above is a clinical trial exclusion criterion. Annotated with entity spans:
[Condition: type 1 diabetic] or [Condition: non-diabetic]